Clinical trial inclusion criterion:
current or former smoker with an accumulated consumption >10 packs x year

Entity relations:
- Has_multiplier("consumption", ">10 packs x year")